Which R package has been developed for MS-based label-free phosphoproteomics?

Phosphonormalizer is a commonly used normalization approach in mass spectrometry-based label-free proteomics. It scales the peptide abundances to have the same median intensities, based on an assumption that the majority of abundances remain the same across the samples.